耳蝸中階（scala media）含內淋巴液（endolymph），其內耳蝸電位（endocochlear potential）為+80 mV，係來 自下列何構造？
A. 血管紋（stria vascularis）
B. 瑞氏膜（Reissner membrane）
C. 基底膜（basilar membrane）
D. 柯蒂氏器（organ of Corti）

正確答案：A. 血管紋（stria vascularis）